陳先生今年 65 歲，因跌坐在地上導致右股骨頸（femoral neck）骨折，接受股後方介入（posterior approach）之髖關節人工關節置換手術，術後 6 週內髖關節擺位應避免下列何者？
A. 外展（abduction）
B. 外旋（external rotation）
C. 內展（adduction）
D. 伸展（extension）

正確答案：C. 內展（adduction）